Clinical trial inclusion criterion:
Be cognitively capable, in the opinion of investigator, to understand and provide such informed consent.

Annotated entities:
- Informed_consent: "Be cognitively capable, in the opinion of investigator, to understand and provide such informed consent"